Clinical trial inclusion criterion:
Rotator cuff tear patients undergoing arthroscopic rotator cuff tear

Annotated entities:
- Condition: "Rotator cuff tear"
- Procedure: "arthroscopic rotator cuff tear"